Clinical trial inclusion criterion:
Karnofskcy performance status (KPS) >_70%.

Entity relations:
- Has_value("Karnofskcy performance status (KPS)", ">_70%")